4. Congenital heart disease;

The above is a clinical trial exclusion criterion. Annotated with entity spans:
4. [Procedure: Congenital heart disease];